Positive family history for ITP

The above is a clinical trial exclusion criterion. Annotated with entity spans:
[Parsing_Error: Positive] [Observation: family history for ITP]